La acetil-CoA carboxilasa:
1. Es una enzima mitocondrial.
2. Su producto es el Succinil-CoA.
3. Requiere biotina como cofactor.
4. Libera ATP.
5. Consume NADH.

Respuesta correcta: 3. Requiere biotina como cofactor.